El número de señales esperadas en el espectro de resonancia magnética nuclear de protón del 1,3-dietil-2-metoxibenceno es:
1. Cuatro.
2. Cinco.
3. Siete.
4. Ocho.

Respuesta correcta: 2. Cinco.